Clinical trial exclusion criterion:
Contact lens-wear during study

Annotated entities:
- Observation: "Contact lens-wear"
- Temporal: "during study"